Clinical trial exclusion criterion:
contraindication against metamizole known or suspected (known or suspected allergy against novalgin or other pyrazolones, anaphylactic reaction against NSAIDS, decreased bone marrow function or hematopoesis, hepatic porphyria, glucose-6-phosphate dehydrogenase deficiency, and pregnancy/breastfeeding)

Entity relations:
- AND("contraindication", "metamizole")
- Has_qualifier("pyrazolones", "other")
- Has_value("bone marrow function", "decreased")
- AND("anaphylactic reaction", "NSAIDS")
- AND("allergy", "novalgin")
- Has_qualifier("allergy", "known")
- Has_qualifier("contraindication", "known")
- Subsumes("contraindication", "allergy")
- OR("known", "suspected")
- OR("bone marrow function", "hematopoesis")
- OR("bone marrow function", "breastfeeding", "glucose-6-phosphate dehydrogenase deficiency", "hepatic porphyria", "pregnancy")
- OR("novalgin", "pyrazolones")
- OR("known", "suspected")
- OR("allergy", "anaphylactic reaction")